Severely or morbidly obese or higher obesity classification (BMI =36)

The above is a clinical trial exclusion criterion. Annotated with entity spans:
[Qualifier: Severely] or [Qualifier: morbidly] [Condition: obese] or [Observation: higher obesity classification] ([Measurement: BMI] [Value: =36])